北洛尼氏病（Peyronie disease）是中年男性發生的陰莖海綿體硬塊，導致：
A. 排尿障礙
B. 陰莖外皮壞死
C. 陰莖彎曲
D. 陰莖紅腫

正確答案：C. 陰莖彎曲